下列何種抗心律不整藥物之作用機轉與 K（potassium）channel 無關？
A. Quinidine
B. Propafenone
C. Sotalol
D. Amiodarone

正確答案：B. Propafenone